有關大腸桿菌（E. coli）DNA之複製過程，下列敘述何者錯誤？
A. 解螺旋酶（helicase）在複製叉（replication fork）上負責解開雙股DNA
B. DNA連接酶（ligase）在延遲股（lagging strand）上催化磷酸雙酯鍵（phosphodiester  	bond）的形成
C. DNA聚合酶I型（DNA polymeraseⅠ）由岡崎片段（Okazaki fragment）的5'端水解RNA
D. DnaA蛋白與oriC位置的GC rich區域結合

正確答案：D. DnaA蛋白與oriC位置的GC rich區域結合